有關肝斑（melasma, chloasma）的敘述，下列何者錯誤？
A. 懷孕時期肝斑出現的機率較高
B. 患者應儘量減少紫外線曝曬
C. 雷射治療效果佳，且不易復發
D. 肝斑跟肝功能異常無關

正確答案：C. 雷射治療效果佳，且不易復發